St. John's wort

The above is a clinical trial exclusion criterion. Annotated with entity spans:
[Condition: St. John's wort]